Clinical trial inclusion criterion:
Pregnant patients who require a scheduled or non-urgent cesarean birth

Annotated entities:
- Condition: "Pregnant"
- Qualifier: "scheduled"
- Qualifier: "non-urgent"
- Procedure: "cesarean birth"